Clinical trial inclusion criterion:
New York Heart Association class II-IV symptoms

Entity relations:
- Has_value("New York Heart Association", "class II-IV")
- AND("symptoms", "New York Heart Association")